關於黴菌感染之血清學診斷之敘述，下列何者正確？
A. chitin 常用於 Blastomyces dermatitidis 之診斷
B. 莢膜多醣類常用於 Cryptococcus neoformans 之診斷
C. 2,4-β-glucans 常用於 Candida 之診斷
D. cord factor 常用於 Aspergillus 之診斷

正確答案：B. 莢膜多醣類常用於 Cryptococcus neoformans 之診斷